What protein is recruited by Crumbs to regulate tracheal development?

In Drosophila, stellate-shaped tracheal terminal cells make seamless tubes, Early endocytosis maintains normal steady-state levels of Crumbs, which recruits apical phosphorylated (active) Moesin (Moe), which in turn regulates seamless tube shape in the development of the trachea.